Control: devoid of any systemic or neurological diseases

The above is a clinical trial inclusion criterion. Annotated with entity spans:
Control: [Negation: devoid] of any [Condition: systemic] or [Condition: neurological diseases]